下列何種藥物不會造成多毛症（hirsutism）？
A. androgens
B. minoxidil
C. phenytoin
D. methimazole

正確答案：D. methimazole